Clinical trial exclusion criterion:
History of malignancy with chemotherapy

Entity relations:
- AND("malignancy", "chemotherapy")